Mujer de 38 años, no fumadora, diagnosticada previamente de rinitis atópica que acude por cuadro de dos meses consistente en tos y sibilantes intermitentes de predominio nocturno. Rx de tórax normal. Espirometría dentro de la normalidad con prueba broncodilatadora negativa. ¿Cuál de las siguientes pruebas solicitaría a continuación?
1. Rx de senos paranasales.
2. TAC torácico.
3. Test de metacolina.
4. Prick-test.

Respuesta correcta: 3. Test de metacolina.